What is the function of a DEAD box protein?

DEAD-box helicase proteins perform ATP-dependent rearrangements of structured RNAs